Clinical trial inclusion criterion:
Patient >18 years of age

Annotated entities:
- Person: "age"
- Value: ">18 years"